下列那一種肝臟良性腫瘤，有較高之惡性轉變的可能性，建議手術切除？
A. cyst
B. adenoma
C. focal nodular hyperplasia
D. hemangioma

正確答案：B. adenoma